Clinical trial inclusion criterion:
Serum transaminases ≤2.5 x ULN.

Entity relations:
- Has_value("Serum transaminases", "≤2.5 x ULN")